How are immediate early genes (IEG) defined?

Immediate-early (IE) genes are the first class of viral genes expressed after primary infection or reactivation. This class of genes is experimentally defined by their transcription following primary infection or reactivation in the presence of inhibitors of protein synthesis.